依奧林匹克運動委員會規定，下列何者為運動員之禁藥，不宜於運動前處方給運動員使用？
A. acetaminophen
B. caffeine
C. anabolic steroid
D. creatine

正確答案：C. anabolic steroid